頭部外傷病患施予頭部電腦斷層檢查的適應症，下列那幾項是正確的？①GCS＜15 分 ②意識喪失 ＞5 分鐘 ③創傷後失憶 ④頭痛合併嘔吐
A. ①②③④
B. 只有①②③
C. 只有②③④
D. 只有①③④

正確答案：A. ①②③④